Current pregnancy or lactation

The above is a clinical trial exclusion criterion. Annotated with entity spans:
Current [Condition: pregnancy] or [Condition: lactation]